Which chromosome contains the TLR7 locus in the human genome?

TLR7 is encoded by a gene on the X chromosome gene, denoted TLR7 in humans and Tlr7 in the mouse. X-Chromosome complement and estrogen receptor signaling independently contribute to the enhanced TLR 7-mediated IFN-α production of plasmacytoid dendritic cells from women.